下列那一種肺癌組織型，為我國最常見者？
A. adenocarcinoma
B. squamous cell carcinoma
C. large cell carcinoma
D. small cell carcinoma

正確答案：A. adenocarcinoma